Known lymphomatous involvement of the CNS.

The above is a clinical trial exclusion criterion. Annotated with entity spans:
Known [Condition: lymphomatous involvement of the CNS].